11. Sexually active women of childbearing age who do not use an acceptable barrier method of birth control

The above is a clinical trial exclusion criterion. Annotated with entity spans:
[Parsing_Error: 11.] [Condition: Sexually active] [Person: women] of [Value: childbearing] [Person: age] who do [Negation: not] use an [Qualifier: acceptable] [Device: barrier method of birth control]